Is currently participating in or has participated in an interventional clinical trial with an investigational compound or device within 30 days of signing the informed consent/assent for this current trial.

The above is a clinical trial exclusion criterion. Annotated with entity spans:
Is [Observation: currently participating] in or [Observation: has participated in an interventional clinical trial] with an [Drug: investigational compound] or [Device: device] [Temporal: within 30 days of signing the informed consent]/assent for this current trial.